Any patient less than 18 years of age

The above is a clinical trial exclusion criterion. Annotated with entity spans:
Any patient [Value: less than 18 years] of [Person: age]